Clinical trial inclusion criterion:
nondiabetic as defined by fasting plasma glucose <126 mg/dL

Annotated entities:
- Condition: "nondiabetic"
- Measurement: "fasting plasma glucose"
- Value: "<126 mg/dL"